Clinical trial exclusion criterion:
Donor is sero-positive in HBV/HCV/HIV or RPR.

Entity relations:
- OR("sero-positive in HBV", "sero-positive in HCV", "sero-positive in RPR", "sero-positive in HIV")